Clinical trial inclusion criterion:
HBV DNA < 6 log IU/ml (LLOD)

Entity relations:
- Has_value("HBV DNA", "< 6 log IU/ml")
- Has_qualifier("HBV DNA", "LLOD")